Clinical trial exclusion criterion:
Hypersensitivity or contradictions to study drugs

Annotated entities:
- Condition: "Hypersensitivity"
- Condition: "contradictions"
- Drug: "study drugs"